Clinical trial exclusion criterion:
2. Screening tools: MRI safety screening questionnaire, Medical history, Medical Assessments: Urine toxicology analyzes for presence of a broad range of prescription and nonprescription drugs.

Entity relations:
- AND("safety screening questionnaire", "MRI")
- multi("MRI safety screening questionnaire", "safety screening questionnaire")
- Has_qualifier("drugs", "prescription")
- AND("Urine toxicology analyzes", "drugs")
- Subsumes("Screening", "MRI safety screening questionnaire")
- Subsumes("Screening", "Medical history")
- Subsumes("Screening", "Urine toxicology analyzes")
- OR("prescription", "nonprescription")